Clinical trial exclusion criterion:
Anticoagulation therapy

Annotated entities:
- Procedure: "Anticoagulation therapy"